Clinical trial exclusion criterion:
re-admission to ICU and has been enrolled during former admission to ICU

Annotated entities:
- Procedure: "re-admission"
- Visit: "ICU"
- Non-representable: "has been enrolled during former admission to ICU"